Severe daytime sleepiness (Epworth sleepiness scale >18)

The above is a clinical trial exclusion criterion. Annotated with entity spans:
[Qualifier: Severe] [Condition: daytime sleepiness] ([Measurement: Epworth sleepiness scale] [Value: >18])